Clinical trial exclusion criterion:
Severe acute illness as defined by Pitt bacteraemia score of >4

Entity relations:
- Has_value("Pitt bacteraemia score", ">4")